Clinical trial exclusion criterion:
Documented or suspected family or personal history of malignant hyperthermia.

Annotated entities:
- Condition: "malignant hyperthermia"
- Temporal: "history family"
- Temporal: "personal history"